Clinical trial inclusion criterion:
Weight: equal to or over 35 kg.

Annotated entities:
- Person: "Weight"
- Value: "equal to or over 35 kg"